Clinical trial inclusion criterion:
Patients with SOF/VEL treatment for the treatment of chronic HCV genotype 1 through 6.

Entity relations:
- Has_value("HCV genotype", "1 through 6")
- Has_qualifier("HCV genotype", "chronic")
- AND("SOF/VEL treatment", "HCV genotype")